Discontinuation of proton pump inhibitors, propulsives, antispasmodics, antacids, or bismuth preparations less than 7 days prior to randomization.

The above is a clinical trial exclusion criterion. Annotated with entity spans:
[Observation: Discontinuation] of [Drug: proton pump inhibitors], [Drug: propulsives], [Drug: antispasmodics], [Drug: antacids], or [Drug: bismuth preparations] [Temporal: less than 7 days prior to randomization].